Clinical trial exclusion criterion:
suffering major events or having mood swings.

Entity relations:
- OR("major events", "mood swings")